Clinical trial exclusion criterion:
Pathologically altered blood pH, or oxygen saturation, or carbon dioxide unless corrected prior to the start of study treatment

Annotated entities:
- Value: "Pathologically altered"
- Measurement: "blood pH"
- Measurement: "oxygen saturation"
- Measurement: "carbon dioxide"